¿Cuál de los siguientes ensayos tiene como objetivo determinar la pérdida de masa de los comprimidos por procesos de abrasión?
1. Dureza.
2. Disgregación.
3. Friabilidad.
4. Disolución.
5. Uniformidad de masa.

Respuesta correcta: 3. Friabilidad.